Clinical trial exclusion criteria:
cauda equina or conus lesion
currently use ventilator
colostomy, or do not perform regular bowel care for any reason
any skin breakdown (pressure sores)
do not speak English
are under 19 years old
are pregnant or think you might be pregnant
medical/psychiatric condition or substance abuse that is likely to affect your ability to complete this study
currently using medications containing lidocaine
allergy to lidocaine

Annotated entities:
- Qualifier: "cauda equina"
- Qualifier: "conus"
- Condition: "lesion"
- Temporal: "currently"
- Procedure: "ventilator"
- Procedure: "colostomy"
- Procedure: "regular bowel care"
- Negation: "do not perform"
- Condition: "skin breakdown"
- Condition: "pressure sores"
- Negation: "not"
- Observation: "speak English"
- Value: "under 19 years"
- Person: "old"
- Condition: "pregnant"
- Mood: "think you might be"
- Condition: "pregnant"
- Condition: "medical condition"
- Condition: "psychiatric condition"
- Condition: "substance abuse"
- Temporal: "currently"
- Drug: "medications containing lidocaine"
- Drug: "lidocaine"
- Condition: "allergy"